Pregnant woman is receiving any drug with antiviral activity or any form of drug therapy for hepatitis B virus

The above is a clinical trial exclusion criterion. Annotated with entity spans:
[Condition: Pregnant] [Person: woman] is receiving any [Drug: drug with antiviral activity] or any form of [Procedure: drug therapy] for [Condition: hepatitis B virus]